Clinical trial exclusion criterion:
physical limitations that might be aggravated by moderate physical activity

Annotated entities:
- Condition: "physical limitations"
- Qualifier: "aggravated by physical activity"
- Qualifier: "moderate"